Clinical trial inclusion criterion:
Sweat chloride equal or greater than 60 mEq/L by quantitative pilocarpine iontophoresis test.

Entity relations:
- Has_value("Sweat chloride", "equal or greater than 60 mEq/L")
- AND("Sweat chloride", "quantitative pilocarpine iontophoresis test")